近年曾在台灣和中國大陸引起流行性腦膜炎，並造成多起死亡病例的細菌，屬於下列何菌屬？
A. 克雷白氏菌（Klebsiella）
B. 綠膿桿菌（Pseudomonas）
C. 奈瑟氏菌（Neisseria）
D. 退伍軍人菌（Legionella）

正確答案：C. 奈瑟氏菌（Neisseria）